Clinical trial inclusion criteria:
Body mass index (BMI): 18 ≤ BMI ≤ 32 kg/m²
Postmenopausal state revealed by:
Medical history, if applicable (natural menopause at least 12 months prior to first study drug administration; or surgical menopause by bilateral ovariectomy at least 3 months prior to first study drug administration), in addition: in women < 65 years old, follicle stimulating hormone (FSH) > 40 IU/L

Annotated entities:
- Measurement: "Body mass index (BMI)"
- Value: "18 ≤ BMI ≤ 32 kg/m²"
- Condition: "Postmenopausal state"
- Parsing_Error: "Postmenopausal state revealed by:"
- Condition: "natural menopause"
- Temporal: "at least 12 months prior to first study drug administration"
- Reference_point: "first study drug administration"
- Condition: "surgical menopause"
- Procedure: "bilateral ovariectomy"
- Temporal: "at least 3 months prior to first study drug administration"
- Reference_point: "first study drug administration"
- Value: "< 65 years"
- Person: "years old"
- Measurement: "follicle stimulating hormone (FSH)"
- Value: "> 40 IU/L"
- Person: "women"